What is TSA-Seq used for?

yes, tsa-seq is a new mapping method capable of providing a cytological ruler for estimating mean chromosomal distances from nuclear speckles genome-wide and for predicting several mbp chromosome trajectories between nuclear compartments without sophisticated computational modeling.